Clinical trial inclusion criterion:
Are between 18 and 70 years of age

Annotated entities:
- Person: "age"
- Value: "between 18 and 70 years"